Active ischemia (acute thrombus diagnosed by coronary angiography, or dynamic ST segment changes demonstrated on ECG) or another reversible cause of VT (e.g. drug-induced arrhythmia), had recent acute coronary syndrome within 30 days, coronary revascularization (<90 days bypass surgery, <30 days percutaneous coronary intervention), or have CCS functional class IV angina. Note that biomarker level elevation alone after ventricular arrhythmias does not denote acute coronary syndrome or active ischemia.

The above is a clinical trial exclusion criterion. Annotated with entity spans:
[Qualifier: Active] [Condition: ischemia] ([Condition: acute thrombus] diagnosed by [Procedure: coronary angiography], or dynamic [Condition: ST segment changes] demonstrated on [Procedure: ECG]) or another [Qualifier: reversible] cause of [Condition: VT] (e.g. [Condition: drug-induced arrhythmia]), had recent [Condition: acute coronary syndrome] [Temporal: within 30 days,] [Procedure: coronary revascularization] ([Temporal: <90 days] [Procedure: bypass surgery], [Temporal: <30 days] [Procedure: percutaneous coronary intervention]), or have [Measurement: CCS functional class] [Value: IV] [Condition: angina]. [Non-query-able: Note that biomarker level elevation alone after ventricular arrhythmias does not denote acute coronary syndrome or active ischemia].